Clinical trial exclusion criterion:
Personal or family history of pancreatitis

Annotated entities:
- Condition: "pancreatitis"